Clinical trial inclusion criterion:
scheduled for elective CD under spinal anesthesia

Entity relations:
- AND("CD", "spinal anesthesia")
- Has_qualifier("CD", "elective")
- Has_mood("CD", "scheduled for")